People with hypersensitivity to local amide-type anesthetics

The above is a clinical trial exclusion criterion. Annotated with entity spans:
People with [Condition: hypersensitivity] to [Drug: local amide-type anesthetics]